Clinical trial inclusion criterion:
HLA-A2 melanoma patients with :

Entity relations:
- Has_qualifier("melanoma", "HLA-A2")